黑水熱（blackwater fever）通常與何種寄生蟲之感染有關？
A. 日本血吸蟲（Schistosoma japonicum）
B. 杜氏利什曼原蟲（Leishmania donovani）
C. 班氏絲蟲（Wuchereria bancrofti）
D. 惡性瘧原蟲（Plasmodium falciparum）

正確答案：D. 惡性瘧原蟲（Plasmodium falciparum）